What the chromsomal location of the gene that is deleted in Potocki-Shaffer syndrome?

Potocki-Shaffer syndrome (PSS) is a rare contiguous gene deletion syndrome caused by heterozygous deletion of 11p11.2p12.